下列有關臍膨出（omphalocele）與腹裂（gastroschisis）的比較，何者正確？
A. 臍膨出有膜覆蓋，且比較少機會合併其他異常
B. 臍膨出有膜覆蓋，且比較多機會合併其他異常
C. 臍膨出沒有膜覆蓋，且比較少機會合併其他異常
D. 臍膨出沒有膜覆蓋，且比較多機會合併其他異常

正確答案：B. 臍膨出有膜覆蓋，且比較多機會合併其他異常